Clinical trial exclusion criterion:
Patient with asthma or COPD, patient who is severely respiratory depressed

Entity relations:
- Has_qualifier("respiratory depressed", "severely")
- OR("asthma", "COPD", "respiratory depressed")